Which R package can infer protein-protein interactions via thermal proximity coaggregation (TPCA)?

Rtpca is an R package implementing methods for inferring protein-protein interactions based on thermal proteome profiling experiments of a single condition or in a differential setting via an approach called thermal proximity coaggregation (TPCA)